男童青春期第二性徵的發育最早出現的變化為：
A. 陰莖變長
B. 睪丸增大
C. 陰囊變薄
D. 陰毛出現

正確答案：B. 睪丸增大